Clinical trial exclusion criterion:
Extra-pulmonary infection requiring antibiotic therapy (e.g. meningitis)

Annotated entities:
- Qualifier: "Extra-pulmonary"
- Condition: "infection"
- Procedure: "antibiotic therapy"
- Condition: "meningitis"